下列有關中央靜脈壓波形之描述，何者錯誤？
A. a 波表示心房的舒張
B. c 波表示三尖瓣關閉
C. x 波表示心室的收縮
D. y 波表示心室的舒張

正確答案：A. a 波表示心房的舒張